35 歲女性，來診主訴無痛性乳頭出血性分泌，病人過去無抽菸喝酒習慣，沒有懷孕過往史，理學檢查無可觸摸腫瘤，腋下無淋巴結腫大，以下何者是最可能的診斷？
A. Paget's disease
B. intraductal papilloma
C. ductal carcinoma
D. fibrocystic disease

正確答案：B. intraductal papilloma